Clinical trial inclusion criterion:
Moderate to severe OSA

Annotated entities:
- Qualifier: "Moderate to severe"
- Condition: "OSA"